下列何種降低痙攣（spasticity）的方法，對於治療腦傷病人的效果最好？
A. 藥物治療
B. 冷熱療法
C. 反射抑制法
D. 牽拉運動治療

正確答案：A. 藥物治療